En la síntesis hepática de metionina a partir de homocisteína se requiere:
1. Metilmalonil-CoA mutasa.
2. Metilcobalamina.
3. 5´-Adenosilcobalamina.
4. Coenzima B6.
5. Metionina adenosil transferasa.

Respuesta correcta: 2. Metilcobalamina.